La diálisis peritoneal es una técnica depurativa que se caracteriza porque:
1. Es necesario administrar siempre heparina por el catéter peritoneal.
2. Está indicada en pacientes con problemas respiratorios de tipo restrictivo.
3. No produce alteraciones hemodinámicas significativas.
4. Requiere la realización de intercambios de solución diurnos y nocturnos cada cuatro horas.
5. Se elimina agua y sustancias tóxicas por ultrafiltración.

Respuesta correcta: 3. No produce alteraciones hemodinámicas significativas.